Current use of fibrates (because of the risk of interaction with statins but will not exclude participants taking ezetimibe).

The above is a clinical trial exclusion criterion. Annotated with entity spans:
Current use of [Drug: fibrates] (because of the risk of interaction with statins but will not exclude participants taking ezetimibe).